Recent CVA clinically confirmed (by neurologist) or neuroimaging confirmed stroke or transient ischemic attack (TIA) within 6 months (180 days) of the procedure.

The above is a clinical trial exclusion criterion. Annotated with entity spans:
Recent [Condition: CVA] [Qualifier: clinically confirmed (by neurologist)] or [Procedure: neuroimaging] [Value: confirmed] [Condition: stroke] or [Condition: transient ischemic attack (TIA)] [Temporal: within 6 months (180 days) of the procedure].